Indique el aminoácido que, en condiciones fisiológicas, tiene una cadena lateral no cargada:
1. Arginina.
2. Ácido aspártico.
3. Ácido glutámico.
4. Lisina.
5. Treonina.

Respuesta correcta: 5. Treonina.